Clinical trial exclusion criterion:
Any major illness (Liver disease, Renal failure, Heart disease, Cancer, etc)

Annotated entities:
- Condition: "major illness"
- Condition: "Liver disease"
- Condition: "Renal failure"
- Condition: "Heart disease"
- Condition: "Cancer"